Clinical trial exclusion criterion:
Chronic heart failure NYHA class III or IV

Entity relations:
- Has_value("NYHA", "class III or IV")
- AND("Chronic heart failure", "NYHA")